腎衰竭（kidney failure）病患其腎髓質細胞所生成之何種成分會減少，因而降低循環中紅血球之數量？
A. Renin
B. GM-CSF
C. G-CSF
D. Erythropoietin

正確答案：D. Erythropoietin